Clinical trial exclusion criterion:
The participant has a history of clinically significant hypertension or other reactions associated with ingestion of tyramine-rich food.

Entity relations:
- Has_qualifier("hypertension", "clinically significant")
- OR("hypertension", "reactions associated with ingestion of tyramine-rich food")